(2)History of allergies to enalapril, folic acid or other components of the compound drug;

The above is a clinical trial exclusion criterion. Annotated with entity spans:
(2)[Temporal: History] of [Condition: allergies] to [Drug: enalapril], [Drug: folic acid] or other [Drug: components of the compound drug];